Clinical trial exclusion criterion:
Allergies to shell fish, seafood, eggs or iodine

Entity relations:
- Has_context("Allergies", "shell fish")
- OR("shell fish", "iodine", "seafood", "eggs")